Clinical trial inclusion criterion:
ASA(American Society of Anesthesiologists) physical status class I or II

Annotated entities:
- Measurement: "ASA physical status class"
- Measurement: "American Society of Anesthesiologists"
- Value: "I or II"